Una mujer de 49 años acude de Urgencias por presentar tiritona, fiebre de 39ºC, dolor en hipocondrio derecho, ictericia y vómitos. La exploración revela TA 100/50 mmHg. FC 110 lpm. Postración y dolor a la palpación en cuadrante derecho, con Murphy positivo. La analítica muestra leucocitosis con desviación izquierda y la ecografía abdominal, colelitiasis, coledocolitiasis y dilatación de la vía biliar extrahepática. Se inicia tratamiento empírico con antibiótico y fluidoterapia. ¿Cuál es el procedimiento más eficaz para realizar a continuación?
1. Mantener tratamiento antibiótico y medidas de soporte con colecistectomía reglada posterior.
2. Colecistectomía laparoscópica.
3. Colocación de un drenaje biliar externo.
4. Colecistectomía urgente con canulación del colédoco.
5. Colangiopancreatografía             retrógrada endoscópica con esfinterotomía.

Respuesta correcta: 5. Colangiopancreatografía             retrógrada endoscópica con esfinterotomía.